Clinical trial exclusion criterion:
Severe systematic disorder

Annotated entities:
- Condition: "Severe systematic disorder"